Clinical trial inclusion criterion:
Patients taking high potency opioid analgesics (e.g., methadone, hydromorphone, morphine)

Entity relations:
- Subsumes("high potency opioid analgesics", "methadone")
- OR("methadone", "morphine", "hydromorphone")